下列何者不是腹腔鏡手術與傳統開腹手術的主要差別？
A. 傷口較小
B. 術後止痛藥需要較少
C. 手術較快
D. 復原較快

正確答案：C. 手術較快